Pulmonary oedema

The above is a clinical trial inclusion criterion. Annotated with entity spans:
[Condition: Pulmonary oedema]